Patients with communication difficulties.

The above is a clinical trial exclusion criterion. Annotated with entity spans:
Patients with [Condition: communication difficulties].